En las etapas del ciclo del ácido cítrico se requiere:
1. NADP+.
2. FAD.
3. Acetil-coenzima A carboxilasa.
4. Glucosa.
5. Al menos una transaminasa.

Respuesta correcta: 2. FAD.